Clinical trial inclusion criteria:
Age=18 years and =80 years;
Patients with non-cystic fibrosis bronchiectasis diagnosed by high-resolution CT;
Are sensitive to amikacin;
Acute exacerbation of bronchiectasis;
Capable of the completion of bronchoscopy, alveolar lavage, pulmonary function testing etc;
Willing to join in and sign the informed consent form.

Annotated entities:
- Person: "Age"
- Value: "=18 years and =80 years"
- Condition: "non-cystic fibrosis bronchiectasis"
- Procedure: "high-resolution CT"
- Condition: "sensitive"
- Drug: "amikacin"
- Condition: "Acute exacerbation of bronchiectasis"
- Post-eligibility: "Capable of the completion of bronchoscopy, alveolar lavage, pulmonary function testing etc"
- Informed_consent: "Willing to join in and sign the informed consent form"